Active bronchospasm or history of hospitalization due to bronchospasm

The above is a clinical trial exclusion criterion. Annotated with entity spans:
[Qualifier: Active] [Condition: bronchospasm] or [Temporal: history] of [Procedure: hospitalization] due to [Condition: bronchospasm]